鼻竇炎引起眼球併發症中，下列何者是最常培養出來的菌種？
A. 綠膿桿菌（Pseudomonas aeruginosa）
B. 白黴菌（mucormycosis）
C. 葡萄球菌（Staphylococcus）
D. 流行感冒嗜血桿菌（Haemophilus influenzae）

正確答案：D. 流行感冒嗜血桿菌（Haemophilus influenzae）